Clinical trial inclusion criterion:
Patients with body weight = 55 kg and = 140 kg and body mass index (BMI) = 18 kg/m2

Entity relations:
- Has_value("body weight", "= 55 kg and = 140 kg")
- Has_value("body mass index (BMI)", "= 18 kg/m2")